ras 基因突變在下列何種肺癌出現之比率最高？
A. 小細胞肺癌
B. 鱗狀上皮細胞癌
C. 腺癌
D. 大細胞肺癌

正確答案：C. 腺癌